Clinical trial inclusion criterion:
Metabolic function, as follows: Serum Magnesium within normal limits. Serum Calcium within normal limits. Serum Potassium within normal limits.

Entity relations:
- Has_value("Serum Magnesium", "within normal limits")
- Has_value("Serum Calcium", "within normal limits")
- Has_value("Serum Potassium", "within normal limits")